What are the 4 cardinal signs of inflammation according to Celsus?

redness or rubor , heat or calor, swelling or tumor, and pain or dolor